Clinical trial exclusion criterion:
Liver enzymes (either AST, ALT, GGPT), or direct bilirubin exceeding 2 x upper limit of normal range

Entity relations:
- Subsumes("Liver enzymes", "AST")
- Has_value("Liver enzymes", "exceeding 2 x upper limit of normal range")
- OR("AST", "ALT", "GGPT")
- OR("Liver enzymes", "direct bilirubin")